Clinical trial exclusion criterion:
Patients who will require magnetic resonance imaging (MRI)

Entity relations:
- Subsumes("magnetic resonance imaging", "MRI")